Clinical trial inclusion criterion:
Clinically significant disease defined as at least 1 painful episode per year averaged over the previous 3 years or a history of priapism, stroke, acute chest syndrome, avascular necrosis, multi-organ failure or the need for chronic narcotic medications for pain from sickle cell disease

Entity relations:
- multi("Clinically significant disease", "Clinically significant")
- multi("averaged over the previous 3 years", "the previous 3 years")
- multi("per year averaged over the previous 3 years at least 1", "averaged over the previous 3 years")
- multi("chronic", "chronic")
- causal("pain", "sickle cell disease")
- causal("narcotic medications", "pain")
- Has_qualifier("narcotic medications", "chronic")
- Has_temporal("priapism", "history")
- Has_multiplier("painful episode", "per year averaged over the previous 3 years at least 1")
- Subsumes("Clinically significant disease", "painful episode")
- Subsumes("Clinically significant disease", "need for")
- OR("painful episode", "multi-organ failure", "avascular necrosis", "acute chest syndrome", "stroke", "priapism", "narcotic medications")